What are the effects of 14-3-3 dimers on Tau phosphorylation?

The 14-3-3 dimers regulate steady-state phosphorylation of both wild-type and mutant Tau proteins.